黑色素細胞（Melanocytes）衍生自：
A. 外胚層（Ectoderm）
B. 中胚層（Mesoderm）
C. 內胚層（Endoderm）
D. 神經外胚層（Neuroectoderm）

正確答案：D. 神經外胚層（Neuroectoderm）